Clinical trial exclusion criterion:
Previous treatment on this study or with a fibroblast growth factor

Annotated entities:
- Temporal: "Previous"
- Procedure: "treatment"
- Drug: "fibroblast growth factor"